有關次發性副甲狀腺功能亢進所導致的病理變化，下列何者錯誤？
A. 副甲狀腺內主細胞（chief cells）增生為主
B. 造成囊狀纖維性骨炎（osteitis fibrosa cystica）
C. 副甲狀腺內的脂肪細胞增多
D. 在多處組織器官可見轉移性鈣化（metastatic calcification）

正確答案：C. 副甲狀腺內的脂肪細胞增多